La ciclación de monosacáridos:
1. Es una reacción catalizada enzimáticamente.
2. Da lugar a enantiómeros D y L.
3. Sucede en las triosas y tetrosas.
4. Genera un nuevo C asimétrico, denominado C anomérico.
5. En las cetosas se produce por formación de un enlace hemiacetal.

Respuesta correcta: 4. Genera un nuevo C asimétrico, denominado C anomérico.